The breast tumor's positive ER/PR rate is <1%, and positive ER-beta1 rate is =10% by IHC.

The above is a clinical trial inclusion criterion. Annotated with entity spans:
The [Condition: breast tumor]'s [Measurement: positive ER/PR rate] is [Value: <1%], and [Measurement: positive ER-beta1 rate] is [Value: =10%] by [Procedure: IHC].